Clinical trial inclusion criterion:
Immunosuppression with tacrolimus and/or mycophenolate (Prednisone use is allowed at low dose, ≤10 mg/d).

Entity relations:
- Subsumes("low dose", "≤10 mg/d")
- Has_multiplier("Prednisone", "low dose")
- AND("Immunosuppression", "tacrolimus")
- OR("tacrolimus", "mycophenolate", "Prednisone")